Clinical trial exclusion criterion:
Expectation that patient will not improve despite treatment of tricuspid regurgitation

Annotated entities:
- Non-query-able: "Expectation that patient will not improve despite treatment of tricuspid regurgitation"